Which micro-RNAs (miR) are associated with the human cycloxygenase-2 (COX-2) gene promoter?

The following micro-RNAs (miRNAs) have been associated with the human cycloxygenase-2 (COX-2) gene promoter: microRNA-16, miRNA-128, micro RNA-26a, miR-142-3p, mir-144, mi r-146b-3 p, mir-16), mir-26b, icroRNA-26 a, MicroRNA-146 b-3P, mir-146a, mir -143-5p, mir microRNA-137, mir--MicroRNA